有關志賀氏桿菌（Shigella）的敘述，下列何者錯誤？
A. 桿菌性痢疾（bacillary dysentery）的主要病原菌
B. 痢疾志賀氏桿菌（Shigella dysenteriae）可產生Shiga toxin
C. 具侵犯性，會侵入腸壁細胞並擴散至鄰近細胞
D. 引發感染需要超過108的菌量

正確答案：D. 引發感染需要超過108的菌量